下列有關瘧疾的敘述，何者錯誤？
A. 寄生蟲病中，導致全球每年患者死亡人數最多的是瘧疾
B. 惡性瘧原蟲的配子母細胞（gametocytes）呈新月形
C. 熱帶性巨脾病（tropical splenomegaly syndrome）是瘧疾的併發症之一
D. 惡性瘧患者因紅血球破壞嚴重，因而常導致腎病症候群

正確答案：D. 惡性瘧患者因紅血球破壞嚴重，因而常導致腎病症候群